impossibility to obtain a signed consent form.

The above is a clinical trial exclusion criterion. Annotated with entity spans:
[Condition: impossibility to obtain] a [Observation: signed consent form].